singleton pregnant women

The above is a clinical trial inclusion criterion. Annotated with entity spans:
[Qualifier: singleton] [Condition: pregnant] [Person: women]